Clinical trial exclusion criterion:
No secure diagnosis of epilepsy

Annotated entities:
- Negation: "No"
- Condition: "epilepsy"